Being or attempting to become pregnant during study follow-up

The above is a clinical trial exclusion criterion. Annotated with entity spans:
[Pregnancy_considerations: Being or attempting to become pregnant during study follow-up]